Clinical trial inclusion criterion:
Age > 18 years old

Annotated entities:
- Person: "Age"
- Value: "> 18 years old"